Clinical trial exclusion criterion:
1. Patients with other uncontrolled infections (see 2.3.2 for definitions)

Annotated entities:
- Parsing_Error: "1."
- Condition: "other uncontrolled infections"
- Context_Error: "other uncontrolled infections"
- Undefined_semantics: "other uncontrolled infections"